下列何者是 Tetracyclines 的抗菌機轉？
A. 結合 50S ribosome 次單元
B. 抑制 translocase 的活性
C. 抑制 Aminoacyl-tRNA 結合到細菌的 ribosomes
D. 抑制 ribosomal peptidyl transferase 的活性

正確答案：C. 抑制 Aminoacyl-tRNA 結合到細菌的 ribosomes